1歲孩童因眼睛無虹膜（aniridia），門診定期接受腹部超音波檢查，1年後發現腹部有腫瘤，下列何種腫瘤最有可能？
A. 威爾姆氏腫瘤（Wilms tumor）
B. 神經母細胞瘤 （neuroblastoma）
C. 生殖細胞瘤 （germ cell tumor）
D. 橫紋肌肉瘤 （rhadomyosarcoma）

正確答案：A. 威爾姆氏腫瘤（Wilms tumor）